免疫細胞分泌tumor necrosis factor（TNF），造成標的細胞的凋亡（apoptosis），下列何者是其正確的作用？
A. TNF無特異性受器，但TNF可結合Fas 受器而引起細胞凋亡
B. TNF活化caspase 8，分解cytochrome c引起細胞凋亡
C. 破壞參與DNA合成的酵素
D. 造成粒線體cytochrome c釋出，引發細胞蛋白質及DNA的破壞

正確答案：D. 造成粒線體cytochrome c釋出，引發細胞蛋白質及DNA的破壞